一位 58 歲的停經女性乳癌患者，接受右側乳房保留手術，術前檢查顯示沒有遠處轉移。術後病理報告顯示腫瘤大小為 2 公分，動情激素受體（estrogen receptor, ER）染色呈陰性，黃體激素受體（progesterone receptor, PR）染色呈陰性，HER2 染色呈陽性，組織分級為第二級，腋下淋巴腺有兩顆轉移。請問患者不需接受下列何項輔助性治療？
A. 化學治療（chemotherapy）
B. 荷爾蒙治療（hormone therapy）
C. 放射治療（radiation therapy）
D. 標靶治療（target therapy）

正確答案：B. 荷爾蒙治療（hormone therapy）